Active fungal infection or pulmonary infiltrates (prior treated disease stable for 2 weeks is allowable)

The above is a clinical trial exclusion criterion. Annotated with entity spans:
Active [Condition: fungal infection] or [Condition: pulmonary infiltrates] ([Condition: prior treated disease] [Qualifier: stable] [Temporal: for 2 weeks] [Negation: is allowable])